一般吞嚥困難的病人在嘗試餵食時，下列方法何者錯誤？
A. 要選在病人比較清醒的時刻
B. 讓病人平躺
C. 以小口餵食
D. 請病人略微低頭進食

正確答案：B. 讓病人平躺